Which molecule is targeted by Camrelizumab?

Camrelizumab is PD-1 (programmed cell death-1 receptor) inhibitor that is used for treatment of cancer.